Evolutive skin disease on the testing zone (lower back).

The above is a clinical trial exclusion criterion. Annotated with entity spans:
[Condition: Evolutive skin disease] on the [Qualifier: testing zone] ([Qualifier: lower back]).